下列何種腎絲球疾病的顯微變化，經銀染色可見腎絲球微血管壁呈現雙層（double contour）或車軌（tramtrack）的形式？
A. 微小變化腎病（minimal change disease）
B. 膜性腎絲球腎炎（membranous glomerulonephritis）
C. 局部分葉性腎絲球硬化（focal segmental glomerulosclerosis）
D. 膜增殖性腎絲球腎炎（membranoproliferative glomerulonephritis）

正確答案：D. 膜增殖性腎絲球腎炎（membranoproliferative glomerulonephritis）